Clinical trial exclusion criterion:
Hepatic impairment (aspartate aminotransferase more than three times normal) or renal function impairment (serum creatinine level >133 µmol/L, Estimated Glomerular Filtration Rate (eGFR) <60)

Entity relations:
- Has_value("Estimated Glomerular Filtration Rate (eGFR)", "<60")
- Has_value("aspartate aminotransferase", "more than three times normal")
- Has_value("serum creatinine level", ">133 µmol/L")
- Subsumes("renal function impairment", "serum creatinine level")
- Subsumes("Hepatic impairment", "aspartate aminotransferase")
- OR("serum creatinine level", "Estimated Glomerular Filtration Rate (eGFR)")
- OR("Hepatic impairment", "renal function impairment")